Group 2: Healthy subjects without known psoriatic disease or cardiovascular disease

The above is a clinical trial inclusion criterion. Annotated with entity spans:
Group 2: [Condition: Healthy] subjects [Negation: without] known [Condition: psoriatic disease] or [Condition: cardiovascular disease]